Clinical trial exclusion criterion:
Prior diagnosis of a class IV cardiovascular disease (according to the New York Heart Association, 1964), hypothyroidism, diabetes mellitus, chronic kidney disease (С3-5), or disease of liver with portal hypertension and/or severe decompensation (Child-Pugh score > 6).

Entity relations:
- Has_value("New York Heart Association", "class IV")
- AND("cardiovascular disease", "New York Heart Association")
- Has_value("С", "3-5")
- AND("chronic kidney disease", "С")
- Has_value("Child-Pugh score", "> 6")
- AND("severe decompensation", "Child-Pugh score")
- OR("cardiovascular disease", "severe decompensation", "hypothyroidism", "diabetes mellitus", "chronic kidney disease", "disease of liver")